Clinical trial exclusion criterion:
Continuous HAs of any kind (i.e., persistent daily HAs with no HA-free period less than 8 hours between attacks)

Entity relations:
- Has_qualifier("HAs", "Continuous")
- Has_value("HA-free period between attacks", "less than 8 hours")
- Has_negation("HA-free period between attacks", "no")
- Has_multiplier("HAs", "daily")
- Has_qualifier("HAs", "persistent")
- AND("HAs", "HA-free period between attacks")
- Subsumes("HAs", "HAs")